Clinical trial inclusion criterion:
finnish or/and swedish speaking

Annotated entities:
- Observation: "finnish speaking"
- Observation: "swedish speaking"